Clinical trial inclusion criterion:
Provision of informed consent prior to any study specific procedures;

Annotated entities:
- Non-query-able: "Provision of informed consent prior to any study specific procedures;"